Clinical trial exclusion criterion:
Patients who receive antineoplastic or immunomodulatory therapy in the past 12 months.

Entity relations:
- Has_temporal("antineoplastic therapy", "past 12 months")
- OR("antineoplastic therapy", "immunomodulatory therapy")